Clinical trial inclusion criteria:
Epilepsy partial seizure subjects.
Currently taking 1 to 3 antiepileptic drugs.

Annotated entities:
- Condition: "Epilepsy"
- Condition: "partial seizure"
- Drug: "antiepileptic drugs"
- Multiplier: "1 to 3"